Clinical trial exclusion criterion:
Subject with symptomatic postural hypotension (severe dizziness or fainting

Annotated entities:
- Condition: "postural hypotension"
- Qualifier: "symptomatic"
- Condition: "dizziness"
- Condition: "fainting"
- Qualifier: "severe"